一位 4 歲男孩因寡尿住院，身體檢查發現男童有全身性水腫。抽血檢查發現血清尿素氮值（blood urea nitrogen）為 42 mg/dL，血清肌酐酸值為 1.8 mg/dL，尿液中之蛋白為 300 mg/dL，尿液的比重（specific gravity）升高，尿液的鈉離子排出率（fractional excretion of sodium; FENa）小於 1%。下列何者為最可能之診斷？
A. 急性腎絲球腎炎（acute glomerulonephritis）合併急性腎衰竭
B. 急性腎小管壞死（acute tubular necrosis）合併急性腎衰竭
C. 急性腎間質腎炎（acute interstitial nephritis）合併急性腎衰竭
D. 低血容（hypovolemia）合併急性腎衰竭

正確答案：A. 急性腎絲球腎炎（acute glomerulonephritis）合併急性腎衰竭